Convulsions, except the ones caused by fever, before 2 years old;

The above is a clinical trial exclusion criterion. Annotated with entity spans:
[Condition: Convulsions], [Negation: except] the ones [Qualifier: caused by fever], [Temporal: before 2 years old];